Clinical trial exclusion criterion:
allergy to Doxycycline or Methylprednisolone,

Annotated entities:
- Drug: "Doxycycline"
- Drug: "Methylprednisolone"
- Condition: "allergy"